Gastric outlet obstruction or intestinal obstruction

The above is a clinical trial exclusion criterion. Annotated with entity spans:
[Condition: Gastric outlet obstruction] or [Condition: intestinal obstruction]